一個三週大的男嬰，因嘔吐而做了一些檢查；下列檢查結果，何者會發生在嬰兒型幽門肥厚狹窄（infantile hypertrophic pyloric stenosis）①腹部X光影像顯示有"double-bubble sign" ②腹部超音波發現胃幽門肌肉的厚度超過 0.4公分 ③上消化道攝影（upper GI series）有string sign   ④上腹部摸到一個像橄欖的腫塊 （olive mass）
A. ①③④
B. ①②④
C. ②③④
D. 僅①③

正確答案：C. ②③④